Clinical trial inclusion criterion:
Men and women 18 years of age and older who are able to complete the neuropsychological tests

Entity relations:
- Has_value("age", "18 years and older")
- Has_context("neuropsychological tests", "able to complete")
- OR("Men", "women")